Which olfactory gene senses androsterone?

Person-to-person differences in androstenone perception are influenced by OR7D4 genotype and perhaps by variants of other genes.